Clinical trial exclusion criterion:
11. Known or suspected allergy/hypersensitivity to any agent given in the course of this trial.

Entity relations:
- AND("allergy", "agent given in the course of this trial")
- Has_mood("allergy", "Known")
- OR("allergy", "hypersensitivity")
- OR("Known", "suspected")